Known coagulation defect

The above is a clinical trial exclusion criterion. Annotated with entity spans:
Known [Condition: coagulation defect]